List causative genes for autosomal recessive forms of monogenic Parkinson's disease

Causative genes for autosomal recessive forms of monogenic Parkinson's disease are:
PARK2
PARK7
PINK1
PARK9
PARK14
PARK15